With hot flashes and with or without active sexual life.

The above is a clinical trial inclusion criterion. Annotated with entity spans:
With [Condition: hot flashes] and [Observation: with] or [Observation: without active sexual life].